Clinical trial exclusion criterion:
Known allergy to one of the study drugs

Entity relations:
- AND("allergy", "study drugs")